Clinical trial exclusion criterion:
Renal transplants from HLA-identical sibling.

Entity relations:
- Has_qualifier("Renal transplants", "HLA-identical sibling")